HCV, HIV, HDV coinfection.

The above is a clinical trial exclusion criterion. Annotated with entity spans:
[Condition: HCV], HIV, [Condition: HDV coinfection].